Clinical trial exclusion criterion:
Use of a fibrinolytic agent, surgical thrombectomy, interventional (catheter-directed) thrombus aspiration or lysis, or use of a cava filter to treat the index episode of PE

Entity relations:
- AND("fibrinolytic agent", "PE")
- OR("fibrinolytic agent", "surgical thrombectomy,", "thrombus aspiration", "thrombus lysis", "cava filter")